有關躁症發作（manic episode）在 DSM-IV-TR 的診斷準則（criteria）之敘述，下列何者錯誤？
A. 膨脹的自尊心或自大狂
B. 睡眠需求減少
C. 持續時間必須至少 3 天
D. 比平時多話或不能克制地說個不停

正確答案：C. 持續時間必須至少 3 天